Clinical trial inclusion criterion:
Healthy adults 30- 65 years old,

Annotated entities:
- Condition: "Healthy"
- Person: "adults"
- Value: "30- 65 years old"
- Person: "old"